陶先生是一位45歲的雜貨店老闆，5年前因為肝硬化接受肝臟移植，術後因為腹內膿瘍反覆的	血性休克，在5個月前的一次休克後，陶先生因為	血性血栓造成大腦多處栓塞性中風變成植物人。這次又因為發燒，血性休克，從護理之家送到急診，你是照顧他的一般外科醫師，家屬希望你盡一切努力救他，需要急救時 就急救，必要時送入加護病房治療；你該如何處理最適當？
A. 醫療資源有限，應避免使用在植物人身上，可請家屬帶他回家
B. 當醫師判定為無效醫療時，應告知家屬你的專業決定，嘗試與家屬達成治療的共識
C. 一律遵照家屬意見，收入加護病房，給予後線抗生素及升壓藥治療
D. 當醫師判定為無效醫療時，應告知家屬你的專業決定，不需要與家屬討論

正確答案：B. 當醫師判定為無效醫療時，應告知家屬你的專業決定，嘗試與家屬達成治療的共識